Clinical trial exclusion criterion:
10. Pregnant or breast feeding

Annotated entities:
- Parsing_Error: "10."
- Condition: "Pregnant"
- Observation: "breast feeding"